Clinical trial exclusion criterion:
Severe dyspnea at rest because of complications of advanced malignancy or requiring current continuous oxygen therapy.

Entity relations:
- Has_qualifier("dyspnea", "Severe")
- Has_temporal("continuous oxygen therapy", "current")
- causal("complications", "advanced malignancy")
- multi("requiring current continuous oxygen therapy", "continuous oxygen therapy")
- causal("dyspnea", "complications")
- OR("complications", "requiring current continuous oxygen therapy")